Clinical trial exclusion criterion:
Patients with chronic kidney disease stage with eGFR < 30 ml/min (CKD stage IV and V)

Entity relations:
- Has_value("eGFR", "< 30 ml/min")
- Has_qualifier("CKD", "stage IV")
- AND("chronic kidney disease", "eGFR")
- OR("stage IV", "stage V")